依我國相關法律規定，下列敘述何者錯誤？
A. 兒童及少年福利法規定，未滿12歲者為兒童
B. 兒童及少年福利法規定，12歲以上18歲未滿者為少年
C. 民法規定，未滿12歲的未成年人無行為能力
D. 民法規定，滿20歲（且未受監護宣告）的人有完全行為能力

正確答案：C. 民法規定，未滿12歲的未成年人無行為能力